Clinical trial exclusion criterion:
Skin infections at the inclusion visit

Entity relations:
- AND("at the inclusion visit", "inclusion visit")
- Has_temporal("Skin infections", "at the inclusion visit")